Clinical trial inclusion criterion:
lack of serious hearing and vision impairment and be able to read so that neurobehavioral tests can be performed.

Annotated entities:
- Negation: "lack of"
- Condition: "vision impairment"
- Condition: "hearing impairment"
- Condition: "able to read"
- Procedure: "neurobehavioral tests"
- Mood: "can be performed"